Clinical trial inclusion criterion:
Age 18 to 80 years old

Annotated entities:
- Person: "Age"
- Value: "18 to 80 years"